Which stapled peptide has been designed to target Ctf4?

The stapled Sld5 peptide was able to displace the Ctf4 partner DNA polymerase α from the replisome in yeast extracts.